Human epidermal growth factor receptor 2 (HER2)-positive.

The above is a clinical trial inclusion criterion. Annotated with entity spans:
[Measurement: Human epidermal growth factor receptor 2 (HER2)]-[Value: positive].